Según el DSM-IV-TR, el trastorno obsesivocompulsivo y el trastorno obsesivo de la personalidad, comparten semejanzas nominales, pero ¿en qué difieren las manifestaciones clínicas?
1. El trastorno obsesivo-compulsivo de la personalidad no se caracteriza por la presencia de obsesiones o compulsiones.
2. El trastorno obsesivo-compulsivo de la personalidad se caracteriza por la presencia de obsesiones sin compulsiones.
3. El trastorno obsesivo-compulsivo de la personalidad se caracteriza por la presencia de compulsiones.
4. El trastorno obsesivo-compulsivo de la personalidad no se caracteriza por la presencia de obsesiones o compulsiones al menos durante 6 meses.
5. El trastorno obsesivo-compulsivo de la personalidad no se caracteriza por la presencia de obsesiones o compulsiones al menos durante 1 año.

Respuesta correcta: 1. El trastorno obsesivo-compulsivo de la personalidad no se caracteriza por la presencia de obsesiones o compulsiones.